Clinical trial inclusion criterion:
Presence of at least 2 ischemic digital cutaneous ulcerations on two different fingers, with digital ulcers classified as "active ulcers" according to the North American working group definition: epithelial denudation is clearly Visible at one place and the bed of de-epithelialized ulcer can be seen; Ulcerations distal to the proximal interphalangeal joint, not associated with calcinosis or bony relief.

Entity relations:
- Has_multiplier("ischemic digital cutaneous ulcerations", "at least 2 on two different fingers")
- Has_qualifier("digital ulcers", "active")
- Subsumes("North American working group definition", "epithelial denudation is clearly Visible at one place and the bed of de-epithelialized ulcer can be seen; Ulcerations distal to the proximal interphalangeal joint, not associated with calcinosis or bony relief")
- Subsumes("active", "North American working group definition")
- AND("ischemic digital cutaneous ulcerations", "digital ulcers")